許先生有肝硬化合併腹水，也出現肝腦病變。最近被發現有日夜昏睡、意識不清的現象，抽血檢查發現NH3 = 110 µg/dL（normal range：19～60），下列何者不是此等病情常見的誘發因子？
A. 便秘
B. 血鉀過高
C. 腸胃道出血
D. 感染

正確答案：B. 血鉀過高